Si valoramos 25 mL de un ácido H2A en concentración 0.1000M (pKa1=5; pKa2=9) con NaOH, el pH cuando hayamos valorado el 50% del ácido inicial será:
1. 1.
2. 3.
3. 5.
4. 7.
5. 9.

Respuesta correcta: 3. 5.